胸骨旁，第五肋間深約 1 公分的穿刺傷，造成大量出血，最可能受傷的動脈是：
A. 最上肋間動脈（supreme intercostal artery）
B. 內胸動脈（internal thoracic artery）
C. 肌膈動脈（musculophrenic artery）
D. 肋下動脈（subcostal artery）

正確答案：B. 內胸動脈（internal thoracic artery）